Serum creatinine level = 3.0 mg/dL

The above is a clinical trial exclusion criterion. Annotated with entity spans:
[Measurement: Serum creatinine level] [Value: = 3.0 mg/dL]